Clinical trial exclusion criteria:
previous treated dupuytrens contracture same hand
more than tree fingers involvement
we will not include thumbs
other things affecting hand function
ASA>3
expected to live under five years
Tetracycline treatment within two weeks
pregnancy
nursing
allergy to clostridium histolyticum
participant in other trial

Annotated entities:
- Temporal: "previous"
- Qualifier: "treated"
- Condition: "dupuytrens contracture"
- Qualifier: "same hand"
- Multiplier: "more than tree"
- Condition: "fingers involvement"
- Non-representable: "we will not include thumbs"
- Condition: "other things"
- Qualifier: "affecting hand function"
- Measurement: "ASA"
- Value: ">3"
- Observation: "expected to live"
- Value: "under five years"
- Drug: "Tetracycline"
- Temporal: "within two weeks"
- Condition: "pregnancy"
- Condition: "nursing"
- Condition: "allergy"
- Observation: "clostridium histolyticum"
- Competing_trial: "participant in other trial"